Clinical trial inclusion criterion:
Male and female subjects aged 9 to 17 months on the day of inclusion

Annotated entities:
- Person: "Male"
- Person: "female"
- Person: "aged"
- Value: "9 to 17 months"
- Temporal: "on the day of inclusion"
- Reference_point: "the day of inclusion"
- Grammar_Error: "and"